Known allergies to aspirin, ticagrelor or cangrelor

The above is a clinical trial exclusion criterion. Annotated with entity spans:
Known [Condition: allergies] to [Drug: aspirin], [Drug: ticagrelor] or [Drug: cangrelor]